Clinical trial exclusion criterion:
Participants who cannot swallow investigational products

Annotated entities:
- Observation: "cannot swallow"
- Drug: "investigational products"